Clinical trial inclusion criterion:
the surgery is laparoscopic surgery and is expected to last for = 2 hours under general anesthesia and the patient will stay in hospital for at least 7 days after surgery.

Entity relations:
- Has_value("last", "= 2 hour")
- Has_mood("last", "expected")
- Has_qualifier("last", "under general anesthesia")
- Has_mood("stay in hospital", "will")
- Has_value("stay in hospital", "at least 7 days after surgery")